neuropathy/sensory impairment of lower limbs

The above is a clinical trial exclusion criterion. Annotated with entity spans:
[Condition: neuropathy]/[Condition: sensory impairment] of [Qualifier: lower limbs]